Clinical trial inclusion criterion:
10. The target lesion(s) is (are) de novo or restenotic (including in-stent restenotic) native coronary artery lesion(s) with greater than 50 and less than 100% stenosis (visual estimate), or the target lesion is an acute (less than 1 month) total occlusion as evidenced by clinical symptoms.

Entity relations:
- Subsumes("de novo", "in-stent restenotic")
- Has_qualifier("target lesion", "de novo")
- Subsumes("target lesion", "coronary artery lesion")
- Has_value("stenosis", "greater than 50 and less than 100%")
- Subsumes("acute", "less than 1 month")
- Has_temporal("target lesion", "acute")
- Has_context("total occlusion", "clinical symptoms")
- Subsumes("target lesion", "total occlusion")
- AND("coronary artery lesion", "stenosis")
- OR("de novo", "restenotic")
- OR("target lesion", "target lesion")